Patients with medical conditions that require chronic systemic corticosteroid therapy or require any other form of immunosuppressive medication. However, patients using physiologic replacement doses of hydrocortisone, or its equivalent, will be considered eligible for this study: up to 20 mg hydrocortisone (or 5 mg of prednisone) in the morning and 10 mg hydrocortisone (or 2.5 mg prednisone) in the evening.

The above is a clinical trial exclusion criterion. Annotated with entity spans:
Patients with [Condition: medical conditions] that [Qualifier: require chronic systemic corticosteroid therapy] or [Qualifier: require] any other form of [Drug: immunosuppressive medication]. However, patients using [Multiplier: physiologic replacement doses] of [Drug: hydrocortisone], or its equivalent, will be considered eligible for this study: [Multiplier: up to 20 mg] [Drug: hydrocortisone] (or [Multiplier: 5 mg] of [Drug: prednisone]) [Multiplier: in the morning] and [Multiplier: 10 mg] [Drug: hydrocortisone] (or [Multiplier: 2.5 mg] [Drug: prednisone]) [Multiplier: in the evening].